Clinical trial exclusion criterion:
hypersensitivity to shrimps, lobsters or beetles

Entity relations:
- Has_qualifier("hypersensitivity", "shrimps")
- OR("shrimps", "beetles", "lobsters")